Which are the types of cancer that c-Myc is associated with?

The types of cancer that c-Myc is associates with are breast cancer, non-small-cell lung cancer and pancreatic ductal adenocarcinoma.